Radiotherapy within 3 weeks of the first dose of 852A

The above is a clinical trial exclusion criterion. Annotated with entity spans:
[Procedure: Radiotherapy] [Temporal: within 3 weeks of the first dose] of [Drug: 852A]